Clinical trial inclusion criterion:
8-22 weeks gestation

Entity relations:
- Has_multiplier("gestation", "8-22 weeks")